¿A qué dimensión (factor) del NEO-PI-R corresponden las facetas de “sentimientos, ideas y valores”?
1. Neuroticismo.
2. Apertura a la experiencia.
3. Amabilidad.
4. Responsabilidad.
5. Extraversión.

Respuesta correcta: 2. Apertura a la experiencia.